Clinical trial exclusion criterion:
Currently taking any psychotropic medications

Entity relations:
- Has_temporal("psychotropic medications", "Currently")